Venous pH less than 7.25

The above is a clinical trial inclusion criterion. Annotated with entity spans:
[Measurement: Venous pH] [Value: less than 7.25]